17. Pregnancy or breast-feeding

The above is a clinical trial exclusion criterion. Annotated with entity spans:
[Parsing_Error: 17.] [Condition: Pregnancy] or [Condition: breast-feeding]